Clinical trial exclusion criterion:
Differential blood count < lower limit of normal (LLN) at Screening

Annotated entities:
- Measurement: "Differential blood count"
- Value: "< lower limit of normal (LLN)"
- Temporal: "at Screening"